Clinical trial inclusion criteria:
Vestibular schwannoma advised to surgical treatment
No measurable remaining vestibular function

Annotated entities:
- Condition: "Vestibular schwannoma"
- Mood: "advised"
- Procedure: "surgical treatment"
- Negation: "No"
- Measurement: "remaining vestibular function"